Clinical trial exclusion criterion:
Subject who is pregnant or breast feeding, or planning to become pregnant during treatment and within 2 months after the discontinuation of study treatment.

Entity relations:
- Has_index("within 2 months after the discontinuation of study treatment", "the discontinuation of study treatment")
- Has_index("during treatment", "treatment")
- Has_temporal("pregnant", "during treatment")
- Has_mood("become pregnant", "planning to")
- OR("pregnant", "breast feeding", "become pregnant")